Clinical trial inclusion criterion:
Diagnosis of uncomplicated gastroschisis

Entity relations:
- Has_qualifier("gastroschisis", "uncomplicated")